Clinical trial exclusion criterion:
Pregnancy related conditions.

Entity relations:
- multi("Pregnancy related", "Pregnancy")
- Has_qualifier("conditions", "Pregnancy related")